25 歲女性至急診，自訴昨晚因沒站穩跌倒，導致全身痠痛。她也提到最近半年常有下腹（骨盆）痛、背痛、倦怠與無力症狀。其丈夫在旁表現出不耐煩，認為她誇大症狀。身體診查發現其左眼眶及四肢有不同程度與時期之瘀青，血壓 130/84 mmHg、脈搏 108/min，下腹部有深的壓痛點，其他無特殊之處。根據這些發現，考量疾病相對之機率，下列何者最有可能？
A. 急性白血病（acute leukemia）
B. 甲狀腺機能低下（hypothyroidism）
C. 出血性疾病（bleeding disorder）
D. 配偶虐待（spouse abuse）

正確答案：D. 配偶虐待（spouse abuse）